Clinical trial inclusion criterion:
Adult outpatients (18 years or older)

Annotated entities:
- Person: "Adult"
- Visit: "outpatients"
- Value: "18 years or older"